Lives in a nursing home (persons living in assisted or independent housing will not be excluded)

The above is a clinical trial exclusion criterion. Annotated with entity spans:
[Observation: Lives in a nursing home] (persons living in assisted or independent housing will not be excluded)